What percentage of human genes have no introns?

Intronless genes, which constitute 3 percent of the human genome, differ from intron-containing genes in evolution and function.